Clinical trial exclusion criterion:
Hypersensitivity to apomorphine or one of the excipients

Entity relations:
- AND("Hypersensitivity", "apomorphine")
- OR("apomorphine", "excipients")